有關liotrix的藥理作用描述，下列何者錯誤？
A. 為L-thyroxine與liothyronine以10:1的比例組合而成的複合藥物
B. 具有治療甲狀腺功能低下症的藥理作用
C. 可以使用於懷孕婦女
D. 口服有效

正確答案：A. 為L-thyroxine與liothyronine以10:1的比例組合而成的複合藥物